Clinical trial exclusion criterion:
Mitral regurgitation moderate or greater

Annotated entities:
- Condition: "Mitral regurgitation"
- Qualifier: "moderate or greater"